Clinical trial exclusion criterion:
Habitual use of opioids

Annotated entities:
- Drug: "opioids"
- Multiplier: "Habitual use"